由遠看近時，所產生的近反射反應（near reflex）不包括下列何者？
A. 調節（accommodation）
B. 會聚（convergence）
C. 瞳孔收縮（constriction of the pupil）
D. 虹彩血管收縮（iris vessel constriction）

正確答案：D. 虹彩血管收縮（iris vessel constriction）